Clinical trial exclusion criterion:
The patient is pregnant or breastfeeding

Annotated entities:
- Pregnancy_considerations: "The patient is pregnant or breastfeeding"